Clinical trial exclusion criterion:
Baseline hemogram with Hb<10g/dL or PLT count<100,000/μL

Annotated entities:
- Procedure: "hemogram"
- Temporal: "Baseline"
- Measurement: "Hb"
- Value: "<10g/dL"
- Measurement: "PLT count"
- Value: "<100,000/μL"